Be willing to abstain from using any nicotine patches, e-cigarettes, or marijuana for the duration of the study.

The above is a clinical trial inclusion criterion. Annotated with entity spans:
[Non-query-able: Be willing to abstain from using any nicotine patches, e-cigarettes, or marijuana for the duration of the study.]